一位 45 歲女性病人，在健康檢查腹部電腦斷層發現一個直徑 3 公分的右腎上腺腫瘤，如何處理最恰當？
A. 轉介病人接受開刀
B. 測試腎上腺皮質、髓質功能
C. 作細針穿刺細胞學檢查
D. 於 6 個月後再做 1 次電腦斷層

正確答案：B. 測試腎上腺皮質、髓質功能